Clinical trial exclusion criterion:
Female participants who are breastfeeding or pregnant at Screening or Baseline (as documented by a positive beta-human chorionic gonadotropin test). A separate Baseline assessment is required if a negative screening pregnancy test was obtained more than 72 hours before the first dose of study drug.

Annotated entities:
- Person: "Female"
- Observation: "breastfeeding"
- Condition: "pregnant"
- Temporal: "at Screening"
- Temporal: "at Baseline"
- Measurement: "beta-human chorionic gonadotropin test"
- Value: "positive"
- Value: "negative"
- Measurement: "screening pregnancy test"
- Qualifier: "separate"
- Procedure: "Baseline assessment"
- Temporal: "more than 72 hours before the first dose of study drug"
- Reference_point: "the first dose of study drug"